El efecto de un inhibidor No competitivo:
1. Se revierte aumentando la concentración de sustrato frente a la del inhibidor.
2. Es independiente de la concentración de sustrato.
3. Disminuye el valor de la Vmax.
4. No afecta a la concentración de sustrato que se requiere para que la enzima alcance una Vi=1/2Vmax.

Respuesta correcta: 3. Disminuye el valor de la Vmax.